Clinical trial inclusion criterion:
At least 18 years of age

Annotated entities:
- Value: "At least 18 years"
- Person: "age"